Clinical trial inclusion criterion:
FEV1 value = 30-80%

Annotated entities:
- Measurement: "FEV1 value"
- Value: "= 30-80%"